Clinical trial exclusion criterion:
Minimum joint space > 2 mm as measured on AP radiograph

Entity relations:
- Has_value("Minimum joint space", "> 2 mm")